Other conditions that would limit clinical assessment of outcomes (e.g. dementia, demyelinating disease, autoimmune disease, etc)

The above is a clinical trial exclusion criterion. Annotated with entity spans:
Other conditions that would limit clinical assessment of outcomes (e.g. [Condition: dementia], [Condition: demyelinating disease], [Condition: autoimmune disease], etc)